下列何者不屬於空氣污染物中所謂的粒狀污染物？
A. 黑煙（soot）
B. 酸霧（acid mist）
C. 油煙（oil smoke）
D. 揮發性有機物（VOCs）

正確答案：D. 揮發性有機物（VOCs）